Con respecto a los alcaloides derivados de la ergolina:
1. Se pueden obtener por fermentación de cultivos puros de Claviceps purpurea y derivan de fenilalanina e isopreno obtenido por la ruta del ácido mevalónico (MVA).
2. Se pueden obtener por fermentación de cultivos puros de Claviceps purpurea y derivan de tirosina e isopreno obtenido por la ruta DOXP.
3. Se pueden obtener por fermentación de cultivos puros de Claviceps purpurea y derivan de triptófano e isopreno obtenido por la ruta del ácido mevalónico (MVA).
4. Se pueden obtener por infección de centeno con esporas de Claviceps purpurea y derivan de triptófano e isopreno obtenido por la ruta DOXP.
5. Se pueden obtener por infección de trigo con esporas de Claviceps purpurea y derivan de tirosina e isopreno obtenido por la ruta del ácido mevalónico (MVA).

Respuesta correcta: 3. Se pueden obtener por fermentación de cultivos puros de Claviceps purpurea y derivan de triptófano e isopreno obtenido por la ruta del ácido mevalónico (MVA).